What does "28" stand for in the Disease Activity Score DAS28?

It stands for the Disease Activity Score 28 Joint Index (DAS28). It’s a measure of how active a patient is in regards to how active they are in relation to the DAS28. The 28 joint DAS (28 joints) is the highest score.